Clinical trial inclusion criterion:
Subject has normal ECG parameters (QRS width in the 12 channel surface ECG =120 ms, QTc - interval < 440 ms, PQ - interval = 210 ms; all parameters should be measured at sinus rhythm).

Entity relations:
- Has_value("ECG", "normal")
- Has_qualifier("QRS width", "12 channel surface ECG")
- Has_value("QRS width", "=120 ms")
- Has_value("QTc - interval", "< 440 ms")
- Has_value("PQ - interval", "= 210 ms")
- Subsumes("ECG", "QRS width")
- Subsumes("ECG", "QTc - interval")
- Subsumes("ECG", "PQ - interval")
- Subsumes("ECG", "sinus rhythm")